下列有關體幹細胞（adult/somatic stem cells）的敘述，何者正確？
A. 肝臟的幹細胞是在哈維氏管（canals of Havers）
B. 腦部的幹細胞是在海馬迴（hippocampus）的 CA1 及 CA2 區
C. 皮膚的幹細胞是在毛囊膨出部（hair follicle bulge）、毛囊間之表皮（interfollicular areas of surface epidermis）及皮脂腺（sebaceous glands）
D. 骨骼肌的幹細胞是在肌外膜（epimysium）之間質細胞

正確答案：C. 皮膚的幹細胞是在毛囊膨出部（hair follicle bulge）、毛囊間之表皮（interfollicular areas of surface epidermis）及皮脂腺（sebaceous glands）